Clinical trial inclusion criterion:
Females 18-65 years old who undergoing colposcopic directed biopsy

Entity relations:
- Has_value("old", "18-65 years")
- Has_temporal("colposcopic directed biopsy", "undergoing")